Clinical trial inclusion criterion:
According multidisciplinary (heart) team decision TAVI is preferable,

Annotated entities:
- Non-representable: "According multidisciplinary (heart) team decision TAVI is preferable,"